女性青春期發育順序，最常出現之順序為：
A. 加速長高→乳芽發育→陰毛生長→初經
B. 乳芽發育→陰毛生長→初經→加速長高
C. 陰毛生長→乳芽發育→加速長高→初經
D. 乳芽發育→加速長高→初經→陰毛生長

正確答案：A. 加速長高→乳芽發育→陰毛生長→初經